¿Qué característica comparten la Anorexia Nerviosa y la Bulimia Nerviosa?:
1. Una idea sobrevalorada de la delgadez.
2. Un bajo Índice de Masa Corporal (IMC) o infrapeso.
3. La presencia de conductas purgativas.
4. La pérdida de control ante alimentos de alto contenido calórico.

Respuesta correcta: 1. Una idea sobrevalorada de la delgadez.